Clinical trial inclusion criterion:
Participants with light chain and free light chain (FLC) only may be enrolled if they meet all the criteria for a diagnosis of MM.

Entity relations:
- Has_value("criteria for a diagnosis of MM", "all")
- AND("light chain and free light chain (FLC)", "criteria for a diagnosis of MM")